Clinical trial inclusion criterion:
Males and females who are at least 18 years of age at time of enrollment.

Annotated entities:
- Person: "Males"
- Person: "females"
- Value: "at least 18 years"
- Person: "age"
- Temporal: "at time of enrollment"
- Reference_point: "time of enrollment"